Clinical trial exclusion criterion:
Post-menopausal women

Annotated entities:
- Observation: "Post-menopausal"
- Person: "women"